Clinical trial inclusion criterion:
Sonographic diagnosis of ovarian endometrioma with diameter at least 4cm on 2 separate scans at least 6 weeks apart

Entity relations:
- AND("Sonographic", "ovarian endometrioma")
- Has_qualifier("ovarian endometrioma", "diameter at least 4cm")
- Has_multiplier("Sonographic", "2 separate scans")
- Has_temporal("2 separate scans", "at least 6 weeks apart")